Clinical trial exclusion criterion:
8. Life expectancy <1 yr.;

Entity relations:
- Has_value("Life expectancy", "<1 yr")